Patients with any active or uncontrolled infection, including known HIV infection. (Patients with active hepatitis B will be placed on lamivudine. Patients with active hepatitis C will be eligible if liver tests qualify (5.1.9)

The above is a clinical trial exclusion criterion. Annotated with entity spans:
Patients with any [Qualifier: active] or [Qualifier: uncontrolled] [Condition: infection], including known [Procedure: HIV infection]. (Patients with [Qualifier: active] [Condition: hepatitis B] will be placed on [Drug: lamivudine]. Patients with [Qualifier: active] [Condition: hepatitis C] will be eligible if [Measurement: liver tests] [Value: qualify] (5.1.9)